Clinical trial inclusion criterion:
Ocular Surface Disease Index (OSDI) >12

Annotated entities:
- Measurement: "Ocular Surface Disease Index"
- Measurement: "OSDI"
- Value: ">12"